Clinical trial inclusion criterion:
Healthy adults 18-45 years of age

Entity relations:
- Has_value("of age", "18-45 years of age")